When did the polio vaccine becomes available?

The Salk polio Vaccine was field tested in 1954.